Uncontrolled medical problems including pulmonary, cardiovascular or orthopedic disease,

The above is a clinical trial exclusion criterion. Annotated with entity spans:
[Qualifier: Uncontrolled] [Condition: medical problems] including [Condition: pulmonary], [Condition: cardiovascular] or [Condition: orthopedic disease],